Polytrauma; undergoing other surgeries or having other orthopedic injuries related to the precipitating cause of the ankle fracture

The above is a clinical trial exclusion criterion. Annotated with entity spans:
[Condition: Polytrauma]; undergoing [Procedure: other surgeries] or having [Condition: other orthopedic injuries] related to the precipitating cause of the [Condition: ankle fracture]